有關咽後膿瘍（retropharyngeal abscess）的敘述，下列何者正確？
A. 成人的咽後膿瘍比孩童更容易擴散到胸縱膈腔
B. 臨床症狀上，成人比孩童容易出現喘鳴（stridor）及頸部水腫
C. 標準的診斷工具是頸部 X 光攝影
D. 大部分的病人，在使用抗生素治療後可以痊癒

正確答案：A. 成人的咽後膿瘍比孩童更容易擴散到胸縱膈腔